Where do mitochondrial DNA deletion breakpoints tend to occur?

Circular dichroism and UV spectral analysis demonstrated that mitochondrial G-rich sequences near deletion breakpoints prevalent in human disease form G-quadruplex DNA structures. Direct repeat sequences are not required at the breakpoints of age-associated mitochondrial DNA deletions in rhesus monkeys. Most of the analyzed deletion breakpoints showed nucleotide repeats flanking the deletions. N this work, we performed a computational analysis of the human mitochondrial genome using the "Pattern Finder" G-quadruplex to known mitochondrial DNA deletion breakpoints.